Clinical trial exclusion criterion:
• Bacille Calmette-Guerin (BCG) vaccination (12 months off drug)

Annotated entities:
- Drug: "Bacille Calmette-Guerin (BCG) vaccination"
- Temporal: "12 months off drug"